Clinical trial inclusion criterion:
Patient must meet 1987 ACR criteria

Annotated entities:
- Condition: "1987 ACR criteria"